阻塞性睡眠障礙（obstructive sleep apnea/hypopnea syndrome，OSAHS）的敘述，下列何者正確？
A. 呼吸中止（apnea）定義為在成年人呼吸停止（breathing pause）≧15 秒
B. 發生率多發生於 BMI（體質比）19～25 的人
C. 增加心肌梗塞（myocardial infarction）風險約 20%
D. 藥物治療（如利尿劑）是優先考量的治療方式

正確答案：C. 增加心肌梗塞（myocardial infarction）風險約 20%